Clinical trial inclusion criterion:
No cases of fragile X syndrome in the family or blepharophimosis syndrome

Entity relations:
- Has_context("fragile X syndrome", "in the family")
- Has_negation("fragile X syndrome", "No")
- OR("fragile X syndrome", "blepharophimosis syndrome")